Patients who live without a home telephone

The above is a clinical trial exclusion criterion. Annotated with entity spans:
[Non-representable: Patients who live without a home telephone]